Clinical trial exclusion criterion:
simultaneous both sided extraction or only upper third molar extraction

Entity relations:
- Has_qualifier("molar extraction", "both sided")
- Has_temporal("molar extraction", "simultaneous")
- OR("both sided", "only upper third")